下列何者不是阿茲海默症（Alzheimer's disease）的早期病徵？
A. 新學習能力障礙
B. 在新環境易迷失方向
C. 命名困難（dysnomia）
D. 遠期記憶（remote memory）障礙

正確答案：D. 遠期記憶（remote memory）障礙